Clinical trial inclusion criterion:
Currently taking 1 to 3 antiepileptic drugs.

Entity relations:
- Has_multiplier("antiepileptic drugs", "1 to 3")